Clinical trial exclusion criterion:
Facilities routinely using decolonization

Entity relations:
- Has_multiplier("decolonization", "routinely")